要執行此項手術的時間點，最好在出生後 2 個星期內手術且最遲不要超過 6 個星期，其原因何在？
A. 心房中隔氣球造口術效果無法持久
B. 超過 6 個星期之後，左心室功能會退化，無法承擔體循環工作
C. 超過 6 個星期之後，母體之抗體消失，易發生手術感染
D. 2 個星期之內手術，冠狀動脈比較容易分離（dissection）

正確答案：B. 超過 6 個星期之後，左心室功能會退化，無法承擔體循環工作